下列有關視網膜細胞瘤調控蛋白（retinoblastoma protein）的敘述，何者正確？
A. 可結合 E2F 轉錄因子，影響基因轉錄
B. 可促進 Rhodopsin kinase 之活化
C. 其激酶（Kinase）活性，可經由磷酸後被活化
D. 為一個致癌基因

正確答案：A. 可結合 E2F 轉錄因子，影響基因轉錄